手術切除（surgical resection）是肝癌目前最理想的治療方式，下列何者發現與手術後之長期預後不佳（poor prognosis）較有關係？
A. large tumor size
B. liver cirrhosis
C. age
D. multifocal tumors

正確答案：D. multifocal tumors